Clinical trial exclusion criterion:
Has a history of latent or active granulomatous infection prior to Screening

Entity relations:
- Has_index("prior to Screening", "Screening")
- Has_qualifier("granulomatous infection", "latent")
- Has_temporal("granulomatous infection", "prior to Screening")
- OR("latent", "active")